成人急性大量失血2000毫升（ml）以上時，下列何者不是臨床常見之表徵？
A. 意識焦慮（anxious）及錯亂（confused）
B. Pulse pressure上升
C. Blood pressure下降
D. 尿量減少

正確答案：B. Pulse pressure上升